癲癇手術使用下列何種影像診斷工具，可以找出結構性之病灶？
A. MRI
B. PET
C. SPECT
D. MRS

正確答案：A. MRI